Clinical trial exclusion criterion:
obstructive sleep apnea

Annotated entities:
- Condition: "obstructive sleep apnea"